Clinical trial exclusion criterion:
6. Other diseases or conditions, for which the doctor of the patients do not agree his or her participating.

Entity relations:
- Has_qualifier("Other diseases", "for which the doctor of the patients do not agree his or her participating")
- OR("Other diseases", "Other conditions")